Intestinal obstruction syndrome

The above is a clinical trial exclusion criterion. Annotated with entity spans:
[Condition: Intestinal obstruction syndrome]